Patients unable or not willing to return for follow-ups.

The above is a clinical trial exclusion criterion. Annotated with entity spans:
[Post-eligibility: Patients unable or not willing to return for follow-ups].